Clinical trial inclusion criterion:
biologic therapy (e.g., bevacizumab) as part of their primary treatment regimen or part of their treatment for management of recurrent or persistent disease.

Annotated entities:
- Drug: "bevacizumab"
- Procedure: "biologic therapy"
- Procedure: "primary treatment regimen"
- Temporal: "persistent"
- Temporal: "recurrent"
- Condition: "disease"
- Procedure: "treatment"
- Context_Error: "recurrent or persistent disease"
- Undefined_semantics: "recurrent or persistent disease"